某君為退休之非洲農耕隊隊員，近日因眼睛有畏光及視力模糊等現象而求醫。經檢查後發現病人之角膜有死亡之微絲蟲，詢問病史，病人陳述多年前在非洲河邊曾被蚋（Simulium spp.）叮咬，但當時不以為意，請問某君最可能感染何種寄生蟲？
A. 羅阿絲蟲（Loa loa）
B. 蟠尾絲蟲（Onchocerca volvulus）
C. 斑氏絲蟲（Wuchereria bancrofti）
D. 馬來絲蟲（Brugia malayi）

正確答案：B. 蟠尾絲蟲（Onchocerca volvulus）